Clinical trial exclusion criterion:
Indwelling continuous thoracic epidural analgesia

Annotated entities:
- Procedure: "thoracic epidural analgesia"
- Qualifier: "continuous"
- Qualifier: "Indwelling"